Clinical trial inclusion criterion:
Age = 18 years and NYHA (New York Heart Association) functional class II, III and IV

Entity relations:
- Has_value("Age", "= 18 years")
- Has_value("NYHA (New York Heart Association) functional class", "II, III and IV")